Clinical trial inclusion criterion:
Have been smoking for at least one year

Annotated entities:
- Observation: "smoking"
- Temporal: "at least one year"